王先生酗酒多年，少吃正常三餐飯食，故體重不足，某日突然發生意識混亂（confusion）、步態不穩運動失調（ataxia），被家人帶到急診室，醫師檢查發現王先生右側眼球呈現水平方向的震顫（horizontal nystagmus），並且眼球無法往外側看（lateral orbital palsy），瞳孔對光反應緩慢，兩側瞳孔大小不一（anisocoria），王先生最可能的臨床診斷是什麼？
A. 腦幹中風（brainstem infarct）
B. 酒精戒斷症候群（alcohol withdrawal syndrome）
C. 魏尼基氏腦症（Wernicke's encephalopathy）
D. 柯沙科夫氏症候群（Korsakoff's syndrome）

正確答案：C. 魏尼基氏腦症（Wernicke's encephalopathy）